What cellular process is the protein clathrin involved in?

Clathrin is a central regulator of endocytosis in all eukaryotes that plays a critical role in the maintenance of cellular homeostasis